下列何者為盛行率？
A. 孕產婦死亡率
B. 青少年氣喘比率
C. 肺癌死亡率
D. 嬰兒死亡率

正確答案：B. 青少年氣喘比率